Se conoce como “temperatura crítica”, TC, a la temperatura:
1. A la que un vidrio reblandece.
2. A la que un vidrio funde.
3. Por debajo de la cual un sólido no muestra resistencia eléctrica.
4. Por debajo de la cual un sólido aumenta su resistencia eléctrica.
5. A la que un cristal funde.

Respuesta correcta: 3. Por debajo de la cual un sólido no muestra resistencia eléctrica.